14. Use of experimental or unapproved immunosuppressant

The above is a clinical trial exclusion criterion. Annotated with entity spans:
[Parsing_Error: 14.] Use of [Undefined_semantics: experimental or unapproved] [Drug: immunosuppressant]